. Inclusion criteria are American Society of Anesthesiologists (ASA) physical status I-III, age between 18 and 70 years and body mass index (BMI) between 20 and 35 kg/m2.

The above is a clinical trial inclusion criterion. Annotated with entity spans:
. Inclusion criteria are [Measurement: American Society of Anesthesiologists] ([Measurement: ASA]) physical status [Value: I-III], [Person: age] [Value: between 18 and 70 years] and [Measurement: body mass index] ([Measurement: BMI]) [Value: between 20 and 35 kg/m2].